succinic semialdehyde dehydrogenase deficiency

The above is a clinical trial exclusion criterion. Annotated with entity spans:
[Condition: succinic semialdehyde dehydrogenase deficiency]